Clinical trial exclusion criterion:
Patients who have received prior chemotherapy for unresectable disease

Entity relations:
- AND("chemotherapy", "unresectable disease")